Clinical trial exclusion criterion:
Contraindication to weight bearing on lower extremities

Annotated entities:
- Observation: "weight bearing on lower extremities"
- Condition: "Contraindication"